Tomamos muestra de cinco individuos a los que les medimos el valor de colesterol LDL (mg/ml) obteniendo: 180, 203, 104, 90 y 165. ¿Cuál es la mediana de esta muestra?:
1. 180.
2. 203.
3. 104.
4. 90.
5. 165.

Respuesta correcta: 5. 165.